上眼瞼（superior palpebra）皮膚之感覺由何神經傳遞？
A. 眼神經（ophthalmic nerve）
B. 視神經（optic nerve）
C. 動眼神經（oculomotor nerve）
D. 面神經（facial nerve）

正確答案：A. 眼神經（ophthalmic nerve）